關於泌乳激素（prolactin）血中濃度與臨床症狀關係之敘述，下列何者錯誤？
A. 血中濃度為2～30 ng/mL時，若無其他機能異常者會正常排卵
B. 隨	血中濃度逐漸升高，可能造成不排卵、無月經及黃體機能不足
C. 泌乳激素（prolactin）的血中濃度會有晝夜節律變化，在晚上10時至凌晨2時達到最低點
D. 血中濃度為100 ng/mL以上時，臨床上會出現無月經

正確答案：C. 泌乳激素（prolactin）的血中濃度會有晝夜節律變化，在晚上10時至凌晨2時達到最低點